Clinical trial inclusion criterion:
PaO2 > 45 mm Hg on room air

Annotated entities:
- Measurement: "PaO2"
- Value: "> 45 mm Hg"
- Qualifier: "on room air"